Clinical trial exclusion criterion:
Weight < 800 g;

Annotated entities:
- Measurement: "Weight"
- Value: "< 800 g"